下列有關咳血之敘述，何者正確？
A. 大量咳血一般被定義為24小時內，出血超過300 mL
B. 就診斷和治療而言，硬式支氣管鏡較軟式支氣管鏡為佳
C. 血管攝影檢查一定要做
D. 血管栓塞術對於出血控制通常無效

正確答案：B. 就診斷和治療而言，硬式支氣管鏡較軟式支氣管鏡為佳